Clinical trial exclusion criterion:
Preoperative renal failure (defined as a serum creatinine > 2.0 mg/dL.)

Annotated entities:
- Temporal: "Preoperative"
- Condition: "renal failure"
- Measurement: "serum creatinine"
- Value: "> 2.0 mg/dL"